4. Severe hypoglycemic episode within 1 month of screening.

The above is a clinical trial exclusion criterion. Annotated with entity spans:
[Parsing_Error: 4.] [Qualifier: Severe] [Condition: hypoglycemic episode] [Temporal: within 1 month of screening].